Clinical trial exclusion criteria:
pregnant or breastfeeding patients
patient with a history of hypersensitivity to colistin

Annotated entities:
- Condition: "pregnant"
- Observation: "breastfeeding"
- Temporal: "history of"
- Condition: "hypersensitivity"
- Drug: "colistin"